Clinical trial exclusion criterion:
History of severe mental illness (as their experience of symptoms may already be altered)

Annotated entities:
- Condition: "mental illness"
- Qualifier: "severe"